Clinical trial inclusion criteria:
Ability to understand and willingness to sign a written informed consent document
Age ≥ 18 years
Histologic diagnosis of chondrosarcoma, verifiable after enrollment
Measurable disease
Previously treated or incurable disease without options for standard of care therapy
ECOG performance status of 0-2
Life expectancy of > 3 months
For patients of reproductive potential (males and females), use of reliable means for contraception (e.g., contraceptive pill, intrauterine device [IUD], physical barrier) throughout the trial and for 1 year following their final exposure to study treatment

Annotated entities:
- Non-query-able: "Ability to understand and willingness to sign a written informed consent document"
- Person: "Age"
- Value: "≥ 18 years"
- Condition: "chondrosarcoma"
- Measurement: "Histologic"
- Context_Error: "Measurable disease"
- Context_Error: "Previously treated or incurable disease without options for standard of care therapy"
- Measurement: "ECOG performance status"
- Value: "0-2"
- Observation: "Life expectancy"
- Value: "> 3 months"
- Condition: "reproductive potential"
- Procedure: "contraception"
- Drug: "contraceptive pill"
- Device: "intrauterine device [IUD]"
- Device: "physical barrier"
- Temporal: "throughout the trial"
- Temporal: "for 1 year following their final exposure"